長期吸菸會引起膀胱癌，與下列何種物質關係最密切？
A. polycyclic aromatic hydrocarbons
B. nitrosonornicotine
C. 4-aminobiphenyl
D. nicotine

正確答案：C. 4-aminobiphenyl